9. Relevant electrocardiograph abnormalities; bradycardia (50 bpm) or tachycardia (120 bpm) under resting conditions.

The above is a clinical trial exclusion criterion. Annotated with entity spans:
[Parsing_Error: 9.] [Qualifier: Relevant] [Procedure: electrocardiograph] [Condition: abnormalities]; [Condition: bradycardia] ([Measurement: 50 bpm]) or [Condition: tachycardia] ([Measurement: 120 bpm]) [Qualifier: under resting conditions].